Clinical trial exclusion criterion:
History or presence of clinically significant drug sensitivity or clinically significant allergic reaction to corticosteroids or salmeterol.

Entity relations:
- AND("drug sensitivity", "corticosteroids")
- OR("corticosteroids", "salmeterol")
- OR("drug sensitivity", "allergic reaction")